How are super enhancers defined?

Super-enhancers are defined as genomic regions spanned by highly conserved non-coding elements (HCNEs), which include both syntenic and nonsyntenic regions, that are easy to recognize and to extract, and are scattered densely throughout the chromosomes of many genes, including those encoding major transcription factors.